Patient who have signed the consent form

The above is a clinical trial inclusion criterion. Annotated with entity spans:
[Post-eligibility: Patient who have signed the consent form]